Clinical trial inclusion criteria:
CHB patients who had received NAs for more than 12 months.
Hepatitis B e antigen (HBeAg)-negative and anti-HBeAg positive.
Hepatitis B surface antigen (HBsAg) positive and <1500 IU/mL.
Hepatitis B virus DNA not detectable(Roche Cobas).

Annotated entities:
- Condition: "CHB"
- Drug: "NAs"
- Temporal: "more than 12 months."
- Measurement: "Hepatitis B e antigen"
- Value: "negative"
- Measurement: "anti-HBeAg"
- Value: "positive"
- Measurement: "HBeAg"
- Measurement: "Hepatitis B surface antigen"
- Measurement: "HBsAg"
- Value: "positive"
- Value: "<1500 IU/mL"
- Measurement: "Hepatitis B virus DNA"
- Value: "not detectable"